Clinical trial exclusion criterion:
UTIs = 12 within 1 year

Entity relations:
- Has_multiplier("UTIs", "12 within 1 year")
- multi("12 within 1 year", "within 1 year")